Severe allergic reactions in anamnesis of autoimmune disease;

The above is a clinical trial exclusion criterion. Annotated with entity spans:
[Qualifier: Severe] [Condition: allergic reactions] in anamnesis of autoimmune disease;